Clinical trial exclusion criteria:
Emergency surgery
Monitored Anesthesia Care (i.e., regional anesthesia alone without plans for general anesthesia)
Surgery involving the eye, eyebrow, forehead, or frontal scalp near the sensor placement
Poor health literacy
Allergy, or have experienced any drug reaction to ketamine
Pregnant or lactating
Currently in active alcohol withdrawal

Annotated entities:
- Procedure: "Emergency surgery"
- Visit: "Emergency"
- Procedure: "Monitored Anesthesia Care"
- Procedure: "regional anesthesia"
- Multiplier: "alone"
- Negation: "without"
- Mood: "plans for"
- Procedure: "general anesthesia"
- Procedure: "Surgery"
- Qualifier: "eye"
- Qualifier: "eyebrow"
- Qualifier: "forehead"
- Qualifier: "frontal scalp"
- Non-representable: "near the sensor placement"
- Observation: "Poor health literacy"
- Condition: "Allergy"
- Condition: "drug reaction"
- Drug: "ketamine"
- Condition: "Pregnant"
- Condition: "lactating"
- Qualifier: "active"
- Condition: "alcohol withdrawal"
- Temporal: "Currently"